How many doses of vaxchora are required?

Vaxchora is a single-dose vaccine.